下列何者為深真皮燒傷的臨床表現？
A. 疼痛、粉紅色並在 21 天內癒合
B. 疼痛、白色並在 21 天後癒合
C. 水泡、粉紅色並在 21 天內癒合
D. 水泡、白色並在 21 天後癒合

正確答案：D. 水泡、白色並在 21 天後癒合